有關細菌 DNA 複製的敘述，那一項錯誤？
A. 可從不特定的 DNA 序列開始
B. 可從多個起始點開始
C. 有不同的機轉並可雙向進行
D. 是由多種 DNA polymerases 來負責

正確答案：A. 可從不特定的 DNA 序列開始